Patients with NOAC preference apart from preference consistent with current cluster randomized NOAC.

The above is a clinical trial exclusion criterion. Annotated with entity spans:
Patients with [Observation: NOAC preference] [Non-representable: apart from preference consistent with current cluster randomized NOAC.]